Clinical trial inclusion criterion:
Musculoskeletal etiology of low back. Patients with non-musculoskeletal etiologies such as urinary tract infection, ovarian cysts, or influenza like illness will be excluded. The primary clinical diagnosis, at the conclusion of the ED visit, must be a diagnosis consistent with non-traumatic, non-radicular, musculoskeletal LBP.

Entity relations:
- Has_qualifier("etiology", "low back")
- Subsumes("etiologies", "urinary tract infection")
- Has_negation("etiologies", "excluded")
- Has_qualifier("LBP", "musculoskeletal")
- Has_qualifier("LBP", "non-radicular")
- Has_qualifier("LBP", "non-traumatic")
- Subsumes("etiology", "LBP")
- Has_negation("musculoskeletal", "non")
- Has_qualifier("etiologies", "musculoskeletal")
- Has_qualifier("etiology", "Musculoskeletal")
- OR("urinary tract infection", "ovarian cysts", "influenza like illness")